Clinical trial exclusion criterion:
Use of oral steroids for no greater than 14 days given for a non-MS condition is not exclusionary.

Entity relations:
- Has_temporal("oral steroids", "no greater than 14 days")
- AND("oral steroids", "non-MS condition")
- Has_negation("oral steroids", "not")